感染下列何種寄生蟲不會出現腸道吸收不良（malabsorption）的症狀？
A. 貝氏等孢子蟲（Isospora belli）
B. 梨形鞭毛蟲（Giardia lamblia）
C. 弓蟲（Toxoplasma gondii）
D. ) 微孢子蟲（Microsporidia spp.）

正確答案：C. 弓蟲（Toxoplasma gondii）